以下有關呼吸器使用之敘述，何者正確？
A. volume-cycled ventilation，每次通氣的氣道壓力相同
B. pressure-cycled ventilation，每次通氣的潮氣量相同
C. pressure support ventilation，每分鐘之通氣量相同
D. controlled mandatory ventilation，每分鐘呼吸次數相同

正確答案：D. controlled mandatory ventilation，每分鐘呼吸次數相同